Clinical trial inclusion criterion:
Female or male, 20 - 80 years of age

Annotated entities:
- Person: "Female"
- Person: "male"
- Value: "20 - 80 years"
- Person: "age"